Clinical trial exclusion criterion:
Active myocarditis; malfunctioning artificial heart valve.

Annotated entities:
- Condition: "Active myocarditis"
- Device: "artificial heart valve"
- Qualifier: "malfunctioning"